En un centro de salud se está realizando un estudio para determinar el efecto de la exposición al humo del tabaco en hijos de padres fumadores. Para ello, se selecciona a un grupo de niños sanos entre 3 y 7 años cuyos padres son fumadores y al mismo tiempo se selecciona en el mismo centro un igual número de niños cuyos padres no son fumadores. Un año después se investigará en ambos grupos la aparición de enfermedades respiratorias durante ese año. Indique la respuesta correcta:
1. El diseño del estudio es una cohorte prospectiva.
2. El diseño del estudio es casos y controles.
3. El diseño del estudio sigue una metodología cualitativa.
4. El estudio es experimental.
5. El tipo de diseño utilizado es eficiente para estudiar enfermedades raras.

Respuesta correcta: 1. El diseño del estudio es una cohorte prospectiva.